Failed response to previous trial of two anti-epileptic drugs. In the case of infantile spasms this could include a trial of corticosteroids.

The above is a clinical trial inclusion criterion. Annotated with entity spans:
[Qualifier: Failed] [Condition: response] to previous trial of [Multiplier: two] [Drug: anti-epileptic drugs]. In the case of infantile spasms this could include a trial of [Drug: corticosteroids].